Clinical trial exclusion criteria:
An initial plasma sodium concentration of lower than 130 mmol/L
An initial plasma sodium concentration of higher than 150 mmol/L
An initial plasma potassium concentration of lower than 3.0 mmol/L
Need for 10% glucose solution
Diabetes
Diabetes insipidus
Diabetic ketoacidosis
Renal disease that needs dialysis
Protocol-determined chemotherapy hydration
Severe liver disease
Inborn errors of metabolism that need protocol-determined fluid therapy

Annotated entities:
- Multiplier: "initial"
- Measurement: "plasma sodium concentration"
- Value: "lower than 130 mmol/L"
- Multiplier: "initial"
- Measurement: "plasma sodium concentration"
- Value: "higher than 150 mmol/L"
- Multiplier: "initial"
- Measurement: "plasma potassium concentration"
- Value: "lower than 3.0 mmol/L"
- Mood: "Need for"
- Drug: "10% glucose solution"
- Condition: "Diabetes"
- Condition: "Diabetes insipidus"
- Condition: "Diabetic ketoacidosis"
- Condition: "Renal disease"
- Mood: "needs"
- Procedure: "dialysis"
- Qualifier: "Protocol-determined"
- Procedure: "chemotherapy hydration"
- Qualifier: "Severe"
- Condition: "liver disease"
- Condition: "Inborn errors of metabolism"
- Mood: "need"
- Qualifier: "protocol-determined"
- Procedure: "fluid therapy"